Clinical trial exclusion criterion:
5. pre-existing neuropathy and medical conditions or deformities which would compromise block or anesthetic safety

Entity relations:
- Has_temporal("neuropathy", "pre-existing")